Clinical trial exclusion criterion:
Autoimmune, rheumatologic or inflammatory disease which are not psoriasis or psoriatic arthritis

Entity relations:
- Has_negation("psoriasis", "not")
- AND("inflammatory disease", "psoriasis")
- OR("inflammatory disease", "disease rheumatologic", "disease Autoimmune")
- OR("psoriasis", "psoriatic arthritis")